What is the target of adalimumab?

Adalimumab is a fully human monoclonal antibody against TNF-alpha.